Life-time history of dependence on cannabis or diagnosis of cannabis use disorder (CUD) according to the DSM 5

The above is a clinical trial exclusion criterion. Annotated with entity spans:
Life-time history of [Condition: dependence on cannabis] or diagnosis of [Condition: cannabis use disorder (CUD)] according to the [Qualifier: DSM 5]